Clinical trial exclusion criterion:
History of allergic disease or reactions likely to be exacerbated by any component of the vaccine (including egg and thiomersal allergy).

Entity relations:
- Subsumes("allergic disease", "egg allergy")
- AND("History", "allergic disease")
- AND("egg allergy", "thiomersal allergy")
- OR("allergic disease", "allergic reactions")